Intellectual Disability

The above is a clinical trial exclusion criterion. Annotated with entity spans:
[Condition: Intellectual Disability]